18-80 year, male or female.

The above is a clinical trial inclusion criterion. Annotated with entity spans:
[Value: 18-80] [Person: year], [Person: male] or [Person: female].